List available R packages for processing NanoString data

NanoStringNorm and NanoStringNormCNV.